Clinical trial exclusion criterion:
Claustrophobia, or the inability to lie still in a confined space

Annotated entities:
- Condition: "Claustrophobia"
- Observation: "inability to lie still in a confined space"